Clinical trial exclusion criterion:
Hemoglobin concentration under 6.5 mmol/l screening

Annotated entities:
- Measurement: "Hemoglobin concentration"
- Value: "under 6.5 mmol/l"